En un hombre diabético de 70 años con antecedentes de cardiopatía isquémica, ¿cuál es la diana terapéutica respecto a cifras de colesterol LDL y Hemoglobina glicosilada (Hb A1c)?
1. LDLc<115 mg/dL y Hb A1c <6.5%.
2. LDLc<100 mg/dL y Hb A1c <7%.
3. LDLc<70 mg/dL y HbA1c <7%.
4. LDLc< 115mg/dL y Hb A1c <7%.

Respuesta correcta: 3. LDLc<70 mg/dL y HbA1c <7%.